Clinical trial inclusion criterion:
Hyperfluorescent areas on indocyanine green angiography (ICGA).

Entity relations:
- AND("indocyanine green angiography (ICGA)", "Hyperfluorescent areas")